Clinical trial inclusion criterion:
Presenting with hernia requiring surgical intervention

Entity relations:
- Has_mood("surgical intervention", "requiring")
- AND("hernia", "surgical intervention")